Clinical trial exclusion criterion:
History of viscosupplementation or platelet-rich plasma to affected shoulder within the last 6 months

Entity relations:
- Has_qualifier("viscosupplementation", "shoulder")
- Has_temporal("viscosupplementation", "last 6 months")
- Has_temporal("viscosupplementation", "History of")
- OR("viscosupplementation", "platelet-rich plasma")